La concepción de cuidar como “mantener la vida asegurando la satisfacción de un conjunto de necesidades indispensables para la vida, pero que son diversas en su manifestación. Las diferentes posibilidades de responder a estas necesidades vitales crean e instauran hábitos de vida propios de cada grupo” corresponde a:
1. D. Orem.
2. V. Henderson.
3. M.F. Colliére.
4. H. Peplau.

Respuesta correcta: 3. M.F. Colliére.